Clinical trial exclusion criterion:
Intubated patients (prior to randomization)

Entity relations:
- Has_index("prior to randomization", "randomization")
- Has_temporal("Intubated", "prior to randomization")